Estimula la lipogénesis y la glucogenosíntesis:
1. Insulina.
2. Glucagon.
3. Cortisol.
4. Adrenalina.
5. GH.

Respuesta correcta: 1. Insulina.